Clinical trial exclusion criterion:
Acute or serious medical illness or unstable chronic medical illness (e.g., unstable angina, myocardial infarction within 6 months, congestive heart failure, clinically significant or concerning cardiac arrhythmias; preexisting hypotension [systolic blood pressure<110] or orthostatic hypotension [systolic drop >20 mm Hg after 2 min standing accompanied by lightheadedness], chronic renal or hepatic failure, acute pancreatitis, Meniere's disease, or diagnosed but untreated sleep apnea). The eligibility of potential participants having acute serious and/or chronic medical illnesses other than those listed will be evaluated on a case-by-case basis by a study physician, PA-C, or ARNP.

Annotated entities:
- Qualifier: "Acute"
- Qualifier: "serious"
- Condition: "medical illness"
- Qualifier: "unstable"
- Condition: "chronic medical illness"
- Condition: "unstable angina"
- Condition: "myocardial infarction"
- Temporal: "within 6 months"
- Condition: "congestive heart failure"
- Qualifier: "clinically significant"
- Qualifier: "concerning"
- Condition: "cardiac arrhythmias"
- Temporal: "preexisting"
- Condition: "hypotension"
- Measurement: "systolic blood pressure"
- Value: "<110"
- Condition: "orthostatic hypotension"
- Measurement: "systolic drop"
- Value: ">20 mm Hg"
- Temporal: "after 2 min standing"
- Condition: "lightheadedness"
- Condition: "chronic renal failure"
- Condition: "hepatic failure"
- Condition: "acute pancreatitis"
- Condition: "Meniere's disease"
- Condition: "sleep apnea"
- Qualifier: "untreated"
- Non-representable: "The eligibility of potential participants having acute serious and/or chronic medical illnesses other than those listed will be evaluated on a case-by-case basis by a study physician, PA-C, or ARNP."